Clinical trial inclusion criterion:
5. Ability to ambulate with or without assistive devices

Annotated entities:
- Parsing_Error: "5."
- Condition: "Ability to ambulate with assistive devices"
- Condition: "Ability to ambulate without assistive devices"